4. inability to comply with follow-up criteria

The above is a clinical trial exclusion criterion. Annotated with entity spans:
4. [Post-eligibility: inability to comply with follow-up criteria]